Clinical trial exclusion criterion:
Awaiting cardiac transplantation or other cardiac surgery within the next 365 days (12 months)

Annotated entities:
- Procedure: "cardiac transplantation"
- Mood: "Awaiting"
- Procedure: "cardiac surgery"
- Temporal: "within the next 365 days"
- Temporal: "within 12 months"